Clinical trial exclusion criterion:
Presence of another vaginal infection or STD

Annotated entities:
- Condition: "vaginal infection"
- Qualifier: "another"
- Condition: "STD"